Clinical trial exclusion criterion:
Patients attending for a therapeutic endoscopic procedure e.g. variceal banding, stent insertion, balloon dilatation.

Annotated entities:
- Procedure: "therapeutic endoscopic procedure"
- Procedure: "variceal banding"
- Procedure: "stent insertion"
- Procedure: "balloon dilatation"